一位患有高血壓的病人，其血壓已用藥物控制，因下肢骨折接受非急診骨科手術，而給予 Epidural anesthesia，按美國麻醉專科醫師學會（ASA）的身體狀況分類是：
A. ASA Class P2
B. ASA Class P3
C. ASA Class P4
D. ASA Class P5

正確答案：A. ASA Class P2